下列有關多發性硬化症（multiple sclerosis）的敘述，何者錯誤？
A. 是週邊神經系統的疾病
B. 腦脊髓液內之腫瘤壞死因子（Tumor Necrosis Factor, TNF）與疾病活動性有關
C. 干擾素治療有療效
D. 相關之病毒為 EBV 及 HHV6

正確答案：A. 是週邊神經系統的疾病